腎素（renin）主要由下列那一細胞產生與釋放？
A. 緻密斑細胞（macula densa cells）
B. 絲球體外環間細胞（extraglomerular mesangial cells）
C. 足細胞（podocytes）
D. 絲球體旁細胞（juxtaglomerular cells）

正確答案：D. 絲球體旁細胞（juxtaglomerular cells）